Clinical trial exclusion criterion:
multiple injuries (polytrauma patients)

Annotated entities:
- Condition: "multiple injuries"
- Condition: "polytrauma"